一名男性AIDS患者自廣東鄉下返台後，呈現發燒、咳嗽、肺部有浸潤、淋巴腫脹、輕微貧血等症狀。血液檢體於25℃培養出類似常見的黴菌，菌絲有分隔（septate hyphae）、分生孢子柄頂端有掃把狀排列之瓶孢子柄（phialides），菌落周邊有紅色色素擴散，在37℃培養則呈現中裂型酵母菌（fission yeast）。最可能罹患下列那種病症？
A. 念珠菌菌血症（candidemia）
B. 隱球菌症（cryptococcosis）
C. 馬爾尼菲青黴菌症（talaromycosis或penicilliosis marneffei）
D. 肺孢子蟲症（pneumocystosis）

正確答案：C. 馬爾尼菲青黴菌症（talaromycosis或penicilliosis marneffei）